En la edición del ARN intervienen los:
1. ARNs ribosomales guías.
2. ARNs transferentes guías.
3. ARNs mensajeros guías.
4. ARNs ribosomales moldes.

Respuesta correcta: 3. ARNs mensajeros guías.